Clinical trial exclusion criterion:
Person is using under arm axillary crutches or walker.

Entity relations:
- OR("under arm axillary crutches", "walker")